Atypical Parkinsonian Syndromes

The above is a clinical trial exclusion criterion. Annotated with entity spans:
[Qualifier: Atypical] [Condition: Parkinsonian Syndromes]